Intraoperative use of vasopressin and uterine tourniquet is permissible

The above is a clinical trial inclusion criterion. Annotated with entity spans:
[Non-representable: Intraoperative use of vasopressin and uterine tourniquet is permissible]